No response to more than one antiarrhythmic drug, or unwilling to receive long-term drug treatment.

The above is a clinical trial inclusion criterion. Annotated with entity spans:
[Negation: No] [Condition: response] to [Multiplier: more than one] [Drug: antiarrhythmic drug], [Non-query-able: or unwilling to receive long-term drug treatment.]